下列那一項為免疫球蛋白（immunoglobulin）基因重組（gene rearrangement）的起始步驟？
A. 重鏈（heavy chain）之V,J剪接
B. 重鏈（heavy chain）之V,D剪接
C. 重鏈（heavy chain）之D,J剪接
D. 輕鏈（light chain）之V,J剪接

正確答案：C. 重鏈（heavy chain）之D,J剪接